Clinical trial exclusion criterion:
Patients with splenectomy

Annotated entities:
- Procedure: "splenectomy"